Clinical trial exclusion criterion:
Contraindication to corticosteroid agents

Entity relations:
- AND("Contraindication", "corticosteroid")